La vasodilatación de las arteriolas aumenta:
1. La resistencia periférica total.
2. La presión arterial.
3. El flujo sanguíneo capilar.
4. La viscosidad de la sangre.

Respuesta correcta: 3. El flujo sanguíneo capilar.